¿Cuál de los siguientes fármacos actúa inhibiendo mecanismos de transporte a través de membranas biológicas?:
1. Raloxifeno.
2. Rabeprazol.
3. Nifedipino.
4. Atorvastatina.

Respuesta correcta: 2. Rabeprazol.